For healthy individuals: Healthy, without allergies and with the age of 18 years or above.

The above is a clinical trial inclusion criterion. Annotated with entity spans:
For [Condition: healthy] individuals: [Condition: Healthy], [Negation: without] [Condition: allergies] and with the [Person: age] of [Value: 18 years or above].